Clinical trial exclusion criterion:
mild (GOLD 1) or very severe COPD (GOLD 4)

Entity relations:
- Has_qualifier("COPD", "mild")
- Has_value("GOLD", "1)")
- AND("COPD", "GOLD")
- Has_qualifier("COPD", "very severe")
- AND("COPD", "GOLD")
- Has_value("GOLD", "4")
- OR("COPD", "COPD")